患有紅斑性狼瘡的高血壓病人，不適合使用下列何種降血壓藥物？
A. Captopril
B. Diazoxide
C. Clonidine
D. Hydralazine

正確答案：D. Hydralazine